Los síntomas de somnolencia diurna excesiva, cataplexia, parálisis del sueño y alucinaciones hipnagógicas describen:
1. La esquizofrenia simple.
2. El insomnio refractario.
3. La narcolepsia.
4. El trastorno de conversión.
5. La criptoamnesia.

Respuesta correcta: 3. La narcolepsia.